有關於消化性潰瘍（peptic ulcer) 的分泌之敘述，何者錯誤？
A. 致病原因（pathogenesis) 包括幽門螺旋桿菌感染（Helicobacter pylori infection），非類固醇性抗發炎藥（nonsteroidal antiinflammatory drugs，NSAID）及胃酸（gastric acid）
B. 90%的十二指腸潰瘍（duodenal ulcer）及75%的胃潰瘍（gastric ulcer）是和幽門螺旋桿菌感染（Helicobacter pylori  	infection）有關
C. 胃潰瘍的病人較常見的分泌異常（secretory abnormalities）有重碳酸鹽分泌減少（decreased bicarbonate secretion），夜間胃酸分泌增加 （increased nocturnal acid secretion）及日間胃酸分泌增加（increased daytime acid secretion）
D. 胃酸過度分泌（gastric acid hypersecretion）在type II及type III的胃潰瘍病人比type I及type IV的胃潰瘍病人較常見

正確答案：C. 胃潰瘍的病人較常見的分泌異常（secretory abnormalities）有重碳酸鹽分泌減少（decreased bicarbonate secretion），夜間胃酸分泌增加 （increased nocturnal acid secretion）及日間胃酸分泌增加（increased daytime acid secretion）